下列何者不是多囊性卵巢症候群（polycystic ovarian syndrome）的血液表現？
A. SHBG（sex hormone binding globulin）增加
B. free estradiol 增加
C. free testosterone 增加
D. LH 增加

正確答案：A. SHBG（sex hormone binding globulin）增加